Willing to provide informed consent

The above is a clinical trial inclusion criterion. Annotated with entity spans:
[Mood: Willing to provide] [Observation: informed consent]